Must be an outpatient with a primary DSM-IV Obsessive-Compulsive Disorder. Patients must have a score of greater than 20 on the Yale-Brown Obsessive Compulsive Scale (Y-BOCS; Goodman et al., 1989b).

The above is a clinical trial inclusion criterion. Annotated with entity spans:
Must be an [Visit: outpatient] with a [Qualifier: primary] [Qualifier: DSM-IV] [Condition: Obsessive-Compulsive Disorder]. Patients must have a [Value: score of greater than 20] on the [Measurement: Yale-Brown Obsessive Compulsive Scale] ([Measurement: Y-BOCS]; Goodman et al., 1989b).